AST or ALT >2 x upper limit of normal (ULN)

The above is a clinical trial exclusion criterion. Annotated with entity spans:
[Measurement: AST] or [Measurement: ALT] [Value: >2 x upper limit of normal (ULN)]